Clinical trial inclusion criteria:
Women seeking medication abortion through 70 days gestation
Eligible for Mifeprex(r) at a study clinical site
English or Spanish speaking
Willing and able to participate in the study, including willing to go to the study pharmacy to obtain mifepristone

Annotated entities:
- Person: "Women"
- Procedure: "medication abortion"
- Temporal: "through 70 days gestation"
- Drug: "Mifeprex(r)"
- Mood: "Eligible for"
- Visit: "study clinical site"
- Observation: "English speaking"
- Observation: "Spanish speaking"
- Observation: "Willing and able to participate in the study"
- Observation: "willing to go to the study pharmacy"
- Drug: "mifepristone"
- Mood: "to obtain"